下列何者為造成化膿性肝膿瘍（pyogenic liver abscess）最常見之感染途徑？
A. 細菌經由門脈血循環至肝臟
B. 膽道感染
C. 肝臟外傷
D. 肝臟鄰近器官受感染後，直接入侵肝臟

正確答案：B. 膽道感染